下列何者不是確診生長激素缺乏症（growth hormone deficiency）之激發試	（provocative test）？
A. Oral glucose tolerance test
B. Arginine test
C. Clondine test
D. Glucagon test

正確答案：A. Oral glucose tolerance test